Clinical trial inclusion criterion:
40-120 kg, inclusive

Entity relations:
- Has_value("kg", "40-120")